Clinical trial exclusion criterion:
Multiple pregnancy (more than 3 fetuses)

Entity relations:
- Has_value("fetuses", "more than 3")
- Subsumes("Multiple pregnancy", "fetuses")